Clinical trial exclusion criteria:
1. Patient with equivocal diagnosis of rupture of membranes
2. advanced labor
3. intrauterine infection
4. vaginal bleeding or
5. non reassuring fetal heart rate.

Annotated entities:
- Parsing_Error: "1."
- Condition: "rupture of membranes"
- Negation: "equivocal"
- Condition: "advanced labor"
- Condition: "intrauterine infection"
- Condition: "vaginal bleeding"
- Parsing_Error: "or"
- Measurement: "fetal heart rate"
- Qualifier: "non reassuring"
- Subjective_judgement: "non reassuring"
- Context_Error: "non reassuring"